Has elevated CRP at Screening or evidence of active inflammation in the sacroiliac joints on MRI

The above is a clinical trial inclusion criterion. Annotated with entity spans:
Has [Value: elevated] [Measurement: CRP] [Temporal: at Screening] or evidence of [Qualifier: active] [Condition: inflammation] in the [Qualifier: sacroiliac joints] on [Procedure: MRI]